腦幹內神經膠質瘤（intrinsic brain stem glioma）的病患大多以何種症狀作為初期表現？
A. 顱神經病變（cranial neuropathies）
B. 頭痛（headache）
C. 水腦症（hydrocephalus）
D. 視神經乳頭水腫（papilledema）

正確答案：A. 顱神經病變（cranial neuropathies）